Clinical trial inclusion criterion:
Must accept treatment plan

Annotated entities:
- Informed_consent: "Must accept treatment plan"